Señale la opción correcta respecto a la calidad de vida de un paciente que pasa por tres estados de salud consecutivos con valores de utilidad de 0,45 el primero, 0,68 el segundo y 0,95 el tercero:
1. La mejor calidad de vida corresponde al tercer estado de salud por el que pasa.
2. La mejor calidad de vida corresponde al primer estado de salud por el que pasa.
3. La calidad de vida depende del tiempo en que esté en cada estado de salud.
4. La utilidad no sirve para valorar la calidad de vida.
5. En los tres estados la calidad de vida es muy mala porque son valores menores de 1.

Respuesta correcta: 1. La mejor calidad de vida corresponde al tercer estado de salud por el que pasa.